Clinical trial exclusion criterion:
Combined P-glycoprotein inducer and strong CYP 3A4 inducer

Entity relations:
- Has_qualifier("CYP 3A4 inducer", "strong")